Clinical trial exclusion criterion:
7. Patients who have had HSCT and are within 100 days of transplant and/or are still taking immunosuppressive drugs and/or have clinically significant graft-versus-host disease requiring treatment and/or have >Grade 1 persistent non hematological toxicity related to the transplant

Annotated entities:
- Temporal: "within 100 days of transplant"
- Condition: "HSCT"
- Temporal: "have had"
- Procedure: "transplant"
- Reference_point: "transplant"
- Drug: "immunosuppressive drugs"
- Qualifier: "clinically significant"
- Subjective_judgement: "clinically significant"
- Condition: "graft-versus-host disease"
- Procedure: "treatment"
- Mood: "requiring"
- Qualifier: ">Grade 1"
- Qualifier: "non hematological"
- Qualifier: "persistent"
- Multiplier: "persistent"
- Condition: "toxicity"
- Procedure: "transplant"
- Temporal: "still"